Patients with severe heart disease history, including ventricular tachycardia (VT), atrial fibrillation (AF), heart block, myocardial infarction (MI), congestive heart failure (CHF), coronary heart disease patients needed therapy;

The above is a clinical trial exclusion criterion. Annotated with entity spans:
Patients with [Qualifier: severe] [Condition: heart disease] history, including [Condition: ventricular tachycardia] ([Condition: VT]), [Condition: atrial fibrillation] ([Condition: AF]), [Condition: heart block], [Condition: myocardial infarction] ([Condition: MI]), [Condition: congestive heart failure] ([Condition: CHF]), [Condition: coronary heart disease] patients needed therapy;